Clinical trial exclusion criterion:
Any major surgical procedure in the preceding 30 days.

Annotated entities:
- Procedure: "major surgical procedure"
- Temporal: "preceding 30 days"